Clinical trial exclusion criterion:
Prior invasive malignancy during the past 3 years other than non-melanomatous skin cancer. Note: Patients with prior surgically-cured malignancies [eg, stage I breast cancer or prostate cancer, in-situ carcinoma of the cervix, etc] are not excluded; however, sponsor approval must be obtained before patient is randomized.

Annotated entities:
- Condition: "malignancy"
- Qualifier: "invasive"
- Temporal: "during the past 3 years"
- Negation: "other than"
- Condition: "non-melanomatous skin cancer"
- Negation: "are not"
- Condition: "surgically-cured malignancies"
- Non-query-able: "sponsor approval must be obtained before patient is randomized"
- Temporal: "Prior"